Clinical trial exclusion criterion:
Contraindications to warfarin or pradaxa according to Russian Instructions for medical use of these drugs

Annotated entities:
- Condition: "Contraindications"
- Drug: "warfarin"
- Drug: "pradaxa"
- Qualifier: "Russian Instructions for medical use"